presence of mobility in the selected tooth

The above is a clinical trial exclusion criterion. Annotated with entity spans:
presence of [Condition: mobility] in the [Qualifier: selected tooth]